List targeted genome editing methodologies

Genome editors such as CRISPR/Cas9 and TALENs are at the forefront of research into methodologies for targeted modification of the mammalian genome. Targeted genome editing (TALEN) was recently introduced as a method to manipulate eukaryotic genomes in a targeted manner with high efficiency and specificity.